Clinical trial inclusion criterion:
Diagnosis of emphysema confirmed by CT scan. If a report of past CT scan is not available at site documenting then a CT scan is to be performed at screening

Annotated entities:
- Condition: "emphysema"
- Procedure: "CT scan"
- Procedure: "CT scan"
- Temporal: "past"
- Negation: "not available"
- Observation: "report of past CT scan"
- Procedure: "CT scan"
- Temporal: "at screening"
- Reference_point: "screening"